¿A qué trastornos nos estamos refiriendo cuando hablamos de una alteración de las funciones integradoras de la conciencia, la identidad, y la memoria?:
1. La esquizofrenia.
2. Los trastornos disociativos.
3. Los trastornos somatoformes.
4. Los trastornos por estrés postraumáticos.
5. Los trastornos del estado de ánimo.

Respuesta correcta: 2. Los trastornos disociativos.